Clinical trial inclusion criterion:
Admitted for labor management & develops a fever of 100.4 F or greater

Annotated entities:
- Procedure: "labor management"
- Mood: "Admitted for"
- Measurement: "fever"
- Value: "100.4 F or greater"